Clinical trial exclusion criterion:
Ibuprofen Allergy/interlerance

Entity relations:
- AND("Allergy", "Ibuprofen")
- AND("interlerance", "Ibuprofen")
- OR("Allergy", "interlerance")